Fasting or postprandial plasma C-peptide more than 100 pmol/L

The above is a clinical trial inclusion criterion. Annotated with entity spans:
[Measurement: Fasting] or [Measurement: postprandial plasma C-peptide] [Value: more than 100 pmol/L]